造成 1997 年香港及 2004 年東南亞各國的禽流感疫情，且有人類死亡病例的禽流感病毒（Avian flu virus），其抗原性為：
A. H7N7
B. H5N2
C. H5N1
D. H9N2

正確答案：C. H5N1